Clinical trial inclusion criteria:
Individuals of both sexes from 18 years with a diagnosis of community-acquired pneumonia, COPD or Bronchial Asthma;
The presence of signed and dated informed consent to participate in a clinical study;
The ability to perform the requirements of the Protocol;
For women of childbearing age is a negative result of a pregnancy test before vaccination.
community-acquired pneumonia: the presence of radiologically confirmed infiltration of the lung tissue; the presence of at least two of the following clinical signs: acute fever early in the disease (temperature > 38.0°C), cough with sputum, the physical signs of pneumonia (focus of crepitate and/or fine bubble rales, bronchial breathing hard, shortening of percussion sounds), leukocytosis > 10*10 9 /l and/or stab shift > 10%; the occurrence of the disease outside the hospital and the organized groups (such as nursing homes, sanatoriums, etc.).
COPD: dyspnea: progressive (worsens over time), increases with exertion, persistent; chronic cough (may appear sporadically and may be unproductive); chronic expectoration; the impact of risk factors in the medical history (Smoking, occupational dust pollutants and chemicals); widespread wheeze on auscultation of the chest and/or distant wheezing in the chest; family history of COPD; spirometric data confirming the presence of fixed bronchial obstruction.

Annotated entities:
- Person: "both sexes"
- Value: "from 18 years"
- Person: "from 18 years"
- Condition: "community-acquired pneumonia"
- Condition: "COPD"
- Condition: "Bronchial Asthma"
- Non-query-able: "The presence of signed and dated informed consent to participate in a clinical study;"
- Post-eligibility: "The ability to perform the requirements of the Protocol;"
- Pregnancy_considerations: "For women of childbearing age is a negative result of a pregnancy test before vaccination."
- Qualifier: "radiologically confirmed"
- Procedure: "radiologically"
- Condition: "infiltration of the lung tissue"
- Multiplier: "at least two"
- Condition: "acute fever"
- Temporal: "early in the disease"
- Measurement: "temperature"
- Value: "> 38.0°C"
- Condition: "cough with sputum"
- Condition: "pneumonia"
- Condition: "physical signs"
- Condition: "crepitate rales"
- Condition: "fine bubble rales"
- Condition: "bronchial breathing hard"
- Condition: "shortening of percussion sounds"
- Measurement: "leukocytosis"
- Value: "> 10*10 9 /l"
- Measurement: "stab shift"
- Value: "> 10%"
- Condition: "community-acquired pneumonia"
- Condition: "dyspnea"
- Qualifier: "progressive"
- Qualifier: "worsens over time"
- Qualifier: "increases with exertion"
- Qualifier: "persistent"
- Condition: "chronic cough"
- Condition: "chronic expectoration"
- Condition: "Smoking"
- Condition: "risk factors"
- Condition: "occupational dust pollutants and chemicals"
- Condition: "wheeze on auscultation of the chest"
- Condition: "distant wheezing in the chest"
- Qualifier: "widespread"
- Observation: "family history"
- Condition: "COPD"
- Procedure: "spirometric"
- Condition: "fixed bronchial obstruction"
- Condition: "COPD"